¿Qué teoría explicaría nuestra necesidad de reducir o eliminar el malestar psicológico producido cuando tenemos que elegir entre dos alternativas igualmente atractivas?
1. Teoría Ingenua de la Acción.
2. Teoría de la Disonancia Cognitiva.
3. Teoría de la Comparación Social.
4. Teoría de la Reactancia Psicológica.
5. Teoría de la Respuesta Cognitiva.

Respuesta correcta: 2. Teoría de la Disonancia Cognitiva.